工人⻑期暴露在有機溶劑環境中，會產生許多危害，⻑期暴露於苯，最可能會發生那種癌症？
A. 血癌
B. 肝癌
C. 腎癌
D. 皮膚癌

正確答案：A. 血癌